Clinical trial exclusion criterion:
Mitral regurgitation moderate or greater

Entity relations:
- Has_qualifier("Mitral regurgitation", "moderate or greater")